有一位選手接受馬拉松長距離訓練兩星期，發生右小腿疼痛，下列敘述何者錯誤？
A. X光可能沒有異常發現
B. 骨骼同位素掃描（bone scan）可能有異常發現
C. 骨骼同位素掃描比磁振造影（MRI）的特異性（specificity）低
D. 骨骼同位素掃描常用來研判預後及骨折癒合

正確答案：D. 骨骼同位素掃描常用來研判預後及骨折癒合